以下何種症狀，不是由幽門桿菌（Helicobacter pylori ）引起？
A. 胃炎（gastritis）
B. 胃淋巴瘤（MALT lymphoma）
C. 食道逆流（gastroesophageal reflux）
D. 胃癌（gastric cancer）

正確答案：C. 食道逆流（gastroesophageal reflux）